Clinical trial exclusion criterion:
Clinically significant laboratory abnormalities

Entity relations:
- Has_qualifier("laboratory abnormalities", "Clinically significant")
- multi("laboratory abnormalities", "laboratory")